¿En cuál de las siguientes posiciones se debe colocar a un paciente para realizarle una gastroscopia?
1. Decúbito lateral derecho.
2. Decúbito lateral izquierdo.
3. Decúbito supino.
4. Trendelemburg.
5. Posición de Sims.

Respuesta correcta: 2. Decúbito lateral izquierdo.